Clinical trial inclusion criterion:
Patients with chronic heart failure present for at least 12 months

Annotated entities:
- Condition: "chronic heart failure"
- Temporal: "for at least 12 months"